Clinical trial exclusion criterion:
Uncontrolled medical problems including pulmonary, cardiovascular or orthopedic disease,

Annotated entities:
- Condition: "medical problems"
- Qualifier: "Uncontrolled"
- Condition: "pulmonary disease"
- Condition: "orthopedic disease"
- Condition: "cardiovascular disease"